Clinical trial inclusion criterion:
Serum or plasma aminotransferases (AST, ALT) less than 3 times the upper limit of normal

Entity relations:
- Subsumes("Serum aminotransferases", "AST")
- Has_value("Serum aminotransferases", "less than 3 times the upper limit of normal")
- OR("Serum aminotransferases", "plasma aminotransferases")
- OR("AST", "ALT")